Capability to understand the informed consent and willing and able to attend study

The above is a clinical trial inclusion criterion. Annotated with entity spans:
[Post-eligibility: Capability to understand the informed consent and willing and able to attend study]